19. Concurrent regular use of another leukotriene pathway inhibitor, including over-the-counter medications or herbal remedies.

The above is a clinical trial exclusion criterion. Annotated with entity spans:
[Parsing_Error: 19.] [Temporal: Concurrent] [Multiplier: regular use] of [Qualifier: another] [Drug: leukotriene pathway inhibitor], including [Undefined_semantics: over-the-counter medications or herbal remedies].